El sumatriptán es un triptano antimigrañoso de primera generación, que se caracteriza estructuralmente por tener un heterociclo:
1. Imidazólico.
2. Piperidínico.
3. Indólico.
4. Pirrólico.
5. Oxazólico.

Respuesta correcta: 3. Indólico.